Clinical trial exclusion criterion:
BMI <18 and> 35 kg / m2

Annotated entities:
- Measurement: "BMI"
- Value: "<18 and> 35 kg / m2"